Clinical trial exclusion criterion:
Pregnant women and young children aged <18 years;

Annotated entities:
- Person: "women"
- Person: "young children"
- Person: "aged"
- Value: "<18 years"